Patients undergoing bilateral hip or knee replacement;

The above is a clinical trial exclusion criterion. Annotated with entity spans:
Patients undergoing [Qualifier: bilateral] [Procedure: hip] or [Procedure: knee replacement];